Clinical trial exclusion criterion:
Poor performance status

Annotated entities:
- Observation: "performance status"
- Value: "Poor"